45 歲男性，5 年前右上肺葉有一空洞性病變，經診斷為肺結核後，經治療一年後完成治療，痰培養轉為陰性，但空洞仍在。病人最近數月有咳血現象，胸部 X 光檢查空洞內出現塊狀物，支氣管痰液培養有放射黴菌（Aspergillus），應作下列何種治療最為有效？
A. 給予抗黴菌藥物
B. 作支氣管血管栓塞
C. 如肺功能許可，作手術切除
D. 給予靜脈注射抗出血藥物

正確答案：C. 如肺功能許可，作手術切除